Clinical trial exclusion criterion:
Patients that are immunologically compromised, or receiving chronic steroids (>30 days), excluding inhalers

Entity relations:
- Has_qualifier("steroids", "chronic")
- Has_temporal("steroids", ">30 days")
- Has_negation("inhalers", "excluding")
- OR("immunologically compromised", "steroids")